Clinical trial inclusion criterion:
ASA physical status I-II

Annotated entities:
- Measurement: "ASA physical status"
- Value: "I-II"